Clinical trial exclusion criterion:
A history of suicidal ideation and behaviour, including self-harm and/or harm to others.

Annotated entities:
- Condition: "suicidal ideation"
- Condition: "suicidal behaviour"
- Condition: "self-harm"
- Condition: "harm to others"